Clinical trial exclusion criterion:
Discharge from the operating hospital to an ICU at another hospital

Entity relations:
- Has_qualifier("hospital", "another")
- AND("Discharge", "operating hospital")
- AND("Discharge", "ICU")
- AND("Discharge", "hospital")